一位 30 歲男性（5 年前罹患癲癇後，雖然接受藥物治療，但仍偶會發作）最近一週被發現自言自語及情緒變得暴躁，他向家人訴說一直有人在他耳邊說話。下列有關癲癇併發精神疾病之敘述，何者錯誤？①癲癇患者最常見之精神問題是憂鬱，而且此憂鬱情緒與其顳葉之病灶有關 ②癲癇患者較常於癲癇發作時併發精神病，較少於兩次癲癇發作中間併發精神病 ③癲癇患者最常見之精神病症狀是幻覺與被害妄想 ④顳葉與額葉病灶之癲癇患者較易有暴力行為
A. ①④
B. ①②
C. ②③
D. ③④

正確答案：B. ①②